Clinical trial exclusion criterion:
Chronic medical disease

Annotated entities:
- Condition: "Chronic medical disease"